Which syndrome is caused by dysfunction of the ciliary ARMC9/TOGARAM1 protein?

Dysfunction of the ciliary ARMC9/TOGARAM1 protein causes Joubert syndrome.